Clinical trial inclusion criterion:
Hamilton Depression Rating Scale-17 score greater than 18.

Annotated entities:
- Measurement: "Hamilton Depression Rating Scale"
- Value: "greater than 18"